Clinical trial exclusion criterion:
History of anticholinergic drug allergy or complications (allergic reaction, skin rash, urticaria and other allergic reactions which caused by drugs).

Annotated entities:
- Drug: "anticholinergic drug"
- Condition: "allergy"
- Condition: "allergic reaction"
- Condition: "skin rash"
- Condition: "urticaria"
- Condition: "allergic reactions"
- Drug: "drugs"
- Qualifier: "other"